En la conocida como “curva de posición serial”, el efecto de recencia se debe a:
1. El funcionamiento de la Memoria a Largo Plazo.
2. El funcionamiento de la Memoria a Corto Plazo.
3. El funcionamiento de la Memoria Ecoica.
4. El funcionamiento de la atención selectiva.

Respuesta correcta: 2. El funcionamiento de la Memoria a Corto Plazo.